La fuente de ionización conocida como Plasma de Acoplamiento Inductivo empleada en Espectrometría de Masas Elemental, se caracteriza por:
1. Generar mayoritariamente iones monoatómicos.
2. Fragmentar las moléculas orgánicas en iones moleculares que permiten su identificación.
3. Ser una fuente de baja energía.
4. Funcionar a alto vacío.
5. Alcanzar límites de detección del orden de los mg L-1 para la mayoría de los elementos.

Respuesta correcta: 1. Generar mayoritariamente iones monoatómicos.